Clinical trial exclusion criterion:
Of childbearing potential with a positive serum pregnancy test, pregnant or lactating

Entity relations:
- Has_value("serum pregnancy test", "positive")
- AND("childbearing potential", "serum pregnancy test")
- OR("childbearing potential", "lactating", "pregnant")